Clinical trial inclusion criterion:
≥ 1 prior regimen (min 2 cycles) with antibody conjugate, cytotoxic chemotherapy, or TKI alone or in combination.

Annotated entities:
- Drug: "antibody conjugate"
- Procedure: "cytotoxic chemotherapy"
- Drug: "TKI"
- Multiplier: "≥ 1 prior regimen"
- Multiplier: "min 2 cycles"